Subject is employed by Medtronic or by the department of any of the investigators or is a close relative of any of the investigators.

The above is a clinical trial exclusion criterion. Annotated with entity spans:
[Post-eligibility: Subject is employed by Medtronic or by the department of any of the investigators or is a close relative of any of the investigators].